Clinical trial exclusion criterion:
History of neuropathic pain, chronic pain syndrome, or preoperative use of narcotic or neuropathic pain medicine

Entity relations:
- Has_temporal("narcotic medicine", "preoperative")
- Has_temporal("neuropathic pain", "History")
- OR("narcotic medicine", "neuropathic pain medicine")
- OR("neuropathic pain", "narcotic medicine", "chronic pain syndrome")